Clinical trial exclusion criterion:
Patient greater than age 16 years

Annotated entities:
- Value: "greater than 16 years"
- Person: "age"